Uno de los objetivos bien establecidos del tratamiento de la anorexia nerviosa es:
1. Sustituir la restricción alimentaria por ejercicio físico.
2. Conseguir el apoyo familiar y proporcionar a la familia asesoramiento.
3. Realizar intervenciones intensivas y breves.
4. Potenciar las estrategias de autoayuda desde el inicio del tratamiento.
5. Separar al paciente de su entorno familiar mientras dura el tratamiento.

Respuesta correcta: 2. Conseguir el apoyo familiar y proporcionar a la familia asesoramiento.